Clinical trial exclusion criterion:
14. Unprotected left main coronary artery disease (stenosis greater than 50%).

Entity relations:
- Has_qualifier("left main coronary artery disease", "Unprotected")
- multi("stenosis", "stenosis")
- Has_value("stenosis", "greater than 50%")
- AND("left main coronary artery disease", "stenosis")